Clinical trial exclusion criterion:
Current diagnostic of asthma

Entity relations:
- Has_temporal("diagnostic of asthma", "Current")